Clinical trial exclusion criterion:
2. CABG or Percutaneous Coronary Intervention (PCI) procedure;

Entity relations:
- OR("CABG", "Percutaneous Coronary Intervention (PCI)")